Clinical trial exclusion criterion:
Zollinger-Ellison syndrome or primary esophageal motility disorders

Annotated entities:
- Condition: "Zollinger-Ellison syndrome"
- Condition: "primary esophageal motility disorders"